Clinical trial exclusion criterion:
Preoperative left ventricular ejection fraction < 30%, sick sinus syndrome, severe sinus bradycardia (< 50 beats per minute), or second-degree or above atrioventricular block without pacemaker;

Entity relations:
- Has_value("left ventricular ejection fraction", "< 30%")
- Has_temporal("left ventricular ejection fraction", "Preoperative")
- Has_value("sinus bradycardia", "< 50 beats per minute")
- Has_qualifier("sinus bradycardia", "severe")
- Has_negation("pacemaker", "without")
- AND("atrioventricular block", "pacemaker")
- Has_qualifier("atrioventricular block", "second-degree or above")
- OR("left ventricular ejection fraction", "sinus bradycardia", "atrioventricular block", "sick sinus syndrome")